Clinical trial exclusion criterion:
severe respiratory disease

Entity relations:
- Has_qualifier("respiratory disease", "severe")